Clinical trial exclusion criterion:
Prior coronary revascularization (PCI or CABG) or myocardial infarction (as evidenced by previously elevated CPK-MB or troponin levels)

Entity relations:
- Has_temporal("CPK-MB levels", "previously")
- Has_value("CPK-MB levels", "elevated")
- Subsumes("myocardial infarction", "CPK-MB levels")
- Subsumes("coronary revascularization", "PCI")
- Has_temporal("coronary revascularization", "Prior")
- Has_temporal("myocardial infarction", "Prior")
- OR("PCI", "CABG")
- OR("CPK-MB levels", "troponin levels")
- OR("coronary revascularization", "myocardial infarction")